Clinical trial inclusion criterion:
Response assessment of complete response (CR), partial response (PR), long stable disease (SD) for >3 months with a cancer immunotherapy treatment for metastatic cancer or hematologic malignancies either through a marketed CPI or through participation in a Roche/Genentech CPI clinical trial.

Entity relations:
- Has_value("Response assessment", "complete response (CR)")
- Has_temporal("complete response (CR)", "for >3 months")
- Has_qualifier("immunotherapy treatment", "cancer")
- AND("immunotherapy treatment", "metastatic cancer")
- OR("complete response (CR)", "long stable disease (SD)", "partial response (PR)")
- OR("marketed CPI", "participation in a Roche/Genentech CPI clinical trial")
- OR("metastatic cancer", "hematologic malignancies")